Clinical trial inclusion criterion:
Moderate to severe central or mixed central and obstructive sleep apnea, defined as an apnea-hypopnea index (AHI) 15 events per hour, with a central AHI >5 events/hour

Entity relations:
- Subsumes("apnea-hypopnea index", "AHI")
- Has_value("apnea-hypopnea index", "15 events per hour,")
- Has_value("central AHI", ">5 events/hour")
- Has_qualifier("central sleep apnea", "Moderate")
- AND("central sleep apnea", "apnea-hypopnea index")
- OR("central sleep apnea", "mixed central sleep apnea", "obstructive sleep apnea")
- OR("Moderate", "severe")